下列何種因子的分泌可減少胃酸的產生？
A. acetylcholine
B. somatostatin
C. gastrin
D. histamine

正確答案：B. somatostatin